Clinical trial exclusion criterion:
1) Refusal of epidural catheter 2) Pregnancy 3) Bleeding History 4) Inability to understand how to use the PCA device 5) Medication interfering with blood coagulation 6) Patients allergic to local anesthetics 7) Patient refusal to participate in study 8) Developmental delay

Entity relations:
- Has_mood("epidural catheter", "Refusal")
- Has_temporal("Bleeding", "History")
- Has_qualifier("Medication", "interfering with blood coagulation")
- AND("allergic", "local anesthetics")